Clinical trial inclusion criterion:
Demonstrate impact of stress urinary incontinence on quality of life questionnaire

Annotated entities:
- Condition: "stress urinary incontinence"
- Procedure: "quality of life questionnaire"